keratinized tissue must be present

The above is a clinical trial inclusion criterion. Annotated with entity spans:
[Condition: keratinized tissue must be present]